Women who are pregnant or lactating

The above is a clinical trial exclusion criterion. Annotated with entity spans:
[Person: Women] who are [Condition: pregnant] or [Condition: lactating]